關於單核細胞增多性李斯特菌（Listeria monocytogenes）的敘述，下列何者錯誤？
A. 是具運動性（motile）的革蘭氏陽性菌
B. 可在細胞質內複製，且利用肌動蛋白（actin）移動至鄰近細胞
C. 主要感染方式為吃進受此菌汙染的食物
D. 此菌能形成內芽胞（endospores）在低溫存活

正確答案：D. 此菌能形成內芽胞（endospores）在低溫存活